Which is the main cause of the Patau syndrome?

Patau syndrome is caused by trisomy 13.